Cefepime可增加下列何種藥物進入細菌（例如：enterococci）的濃度，因此二者併用可增加抗菌作用 ？
A. amantadine
B. amikacin
C. azlocillin
D. aztreonam

正確答案：B. amikacin